Children aged 0-59 months living with families registered in the rural Bandim Health Project Health and Demographic Surveillance Site are included, provided a parent/guardian consent.

The above is a clinical trial inclusion criterion. Annotated with entity spans:
[Person: Children] [Person: aged] [Value: 0-59 months] [Observation: living with families registered in the rural Bandim Health Project Health] and [Visit: Demographic Surveillance Site] are included, provided a parent/guardian consent.